Clinical trial exclusion criterion:
Evidence of ongoing viral infection with HCV, HBV and/or HIV.

Annotated entities:
- Condition: "viral infection"
- Condition: "HCV"
- Condition: "HBV"
- Condition: "HIV"
- Temporal: "ongoing"